Other heart conditions being treated by a physician

The above is a clinical trial exclusion criterion. Annotated with entity spans:
[Condition: Other heart conditions] being treated by a physician